¿Cuál es el punto de referencia anatómico, en el tórax, que se aproxima a la posición del vértice del corazón?:
1. Ángulo esternal.
2. Tercer espacio intercostal izquierdo.
3. Quinto espacio intercostal izquierdo.
4. Apófisis xifoides esternal.

Respuesta correcta: 3. Quinto espacio intercostal izquierdo.